Clinical trial inclusion criteria:
Patients with heart transplantation
Patient with coronary artery disease
Age between 18 and 80 years

Annotated entities:
- Procedure: "heart transplantation"
- Condition: "coronary artery disease"
- Person: "Age"
- Value: "between 18 and 80 years"